Chronic retention

The above is a clinical trial exclusion criterion. Annotated with entity spans:
[Condition: Chronic retention]